關於抗精神病藥（antipsychotics）的副作用及其主要藥物機轉之配對，下列何者正確？
A. 口乾：血清素（serotonin）再回收阻斷作用
B. 姿勢性低血壓（orthostatic hypotension）：甲型腎上腺素受體（α adrenergic receptors）阻斷作用
C. 錐體外症候群（extrapyramidal syndrome）：多巴胺（dopamine）再回收阻斷作用
D. 尿液滯留：甲型腎上腺素受體（α adrenergic receptors）阻斷作用

正確答案：B. 姿勢性低血壓（orthostatic hypotension）：甲型腎上腺素受體（α adrenergic receptors）阻斷作用